Patients without history of inner ear disease

The above is a clinical trial inclusion criterion. Annotated with entity spans:
Patients [Negation: without] [Temporal: history] of [Condition: inner ear disease]